Arterial occlusive disease per ankle Brachial index measurements and/or other imaging modalities,

The above is a clinical trial inclusion criterion. Annotated with entity spans:
[Condition: Arterial occlusive disease] per [Procedure: ankle Brachial index measurements] and/or other [Procedure: imaging modalities],